Clinical trial inclusion criterion:
inhalational induction scheduled

Annotated entities:
- Procedure: "inhalational induction"
- Mood: "scheduled"